一位18歲少女當月經來潮時會有腹部疼痛的症狀，醫師詳細檢查發現有骨盆腹膜子宮內膜異位的病變。下列何者較適合被用來治療這位病人？
A. 口服flutamide
B. 肌肉注射medroxyprogesterone
C. 靜脈注射oxandrolone
D. 口服raloxifene

正確答案：B. 肌肉注射medroxyprogesterone